No concurrent use of isoniazid, labetolol, trovafloxacin, tolcapone, and felbamate

The above is a clinical trial exclusion criterion. Annotated with entity spans:
[Negation: No] concurrent use of [Drug: isoniazid], [Drug: labetolol], [Drug: trovafloxacin], [Drug: tolcapone], and [Drug: felbamate]